Clinical trial exclusion criterion:
Age of＜18y or＞75y

Annotated entities:
- Person: "Age"
- Value: "＜18y or＞75y"